5歲男童因嚴重腦部創傷後一年就診，小兒科醫師發現其嚴重地發育遲緩，並且生化檢測發現其明顯的生長激素（growth hormone）分泌不足，因此投予生長激素治療。在治療階段中發現其血中生長激素濃度已達正常，但生長遲緩情形未見改善，下列何者解釋可能可以用來說明生長激素替代治療無效的原因？
A. 其可能體制素（somatostatin）分泌過量
B. 其可能生長激素受體的表現量不足
C. 其可能發生繼發性甲狀腺機能減退（secondary hypothyroidism）
D. 其可能生長激素在體內的代謝速率過快

正確答案：C. 其可能發生繼發性甲狀腺機能減退（secondary hypothyroidism）